Abnormal nasal potential difference (NPD) as measured by a change in NPD in response to a low chloride solution and isoproterenol of less than -5 mV.

The above is a clinical trial inclusion criterion. Annotated with entity spans:
[Value: Abnormal] [Measurement: nasal potential difference] ([Measurement: NPD]) [Non-query-able: as measured by a change in NPD in response to a low chloride solution and isoproterenol of] [Value: less than -5 mV].